Type II diabetes mellitus;

The above is a clinical trial exclusion criterion. Annotated with entity spans:
[Condition: Type II diabetes mellitus];